Clinical trial inclusion criterion:
Patient is indicated to have an ocular refractive surgery performed (myopia, astigmatism, hypermetropy) by the Lasik method.

Annotated entities:
- Procedure: "ocular refractive surgery"
- Condition: "indicated to have an ocular refractive surgery performed"
- Condition: "myopia"
- Condition: "astigmatism"
- Condition: "hypermetropy"
- Qualifier: "Lasik method"